Clinical trial exclusion criterion:
Hypersensitivity to perflutren, blood, blood products or albumin

Annotated entities:
- Condition: "Hypersensitivity"
- Drug: "perflutren"
- Procedure: "blood"
- Procedure: "blood products"
- Drug: "albumin"